下列何種蛋白質結構的變異，是導致成骨不全症（osteogenesis imperfecta）的原因？
A. 纖黏蛋白（fibronectin）
B. 骨橋蛋白（osteopontin）
C. 角質蛋白（keratin）
D. 膠原蛋白（collagen）

正確答案：D. 膠原蛋白（collagen）